Ante un paciente de 8 años de edad que acude por presentar desde hace 3 días lesiones pustulosas superficiales, erosiones y costras amarillentas alrededor de la boca pensaremos en:
1. Eritema exudativo multiforme.
2. Impétigo contagioso.
3. Acné infantil.
4. Psoriasis pustuloso.

Respuesta correcta: 2. Impétigo contagioso.